Clinical trial inclusion criterion:
Severe hyperchloraemia

Annotated entities:
- Condition: "hyperchloraemia"
- Qualifier: "Severe"